Awake resting oxyhemoglobin saturation <89%

The above is a clinical trial exclusion criterion. Annotated with entity spans:
[Qualifier: Awake] [Qualifier: resting] [Measurement: oxyhemoglobin saturation] [Value: <89%]